Clinical trial exclusion criterion:
Evidence of significant physical illness contraindicating the use of levomilnacipran and duloxetine found on the physical exam or in the laboratory data obtained during the first week of the study

Entity relations:
- AND("physical illness", "contraindicating")
- AND("contraindicating", "levomilnacipran")
- AND("physical illness", "physical exam")
- Has_temporal("physical exam", "during the first week of the study")
- OR("levomilnacipran", "duloxetine")
- OR("physical exam", "laboratory")